下列何者不是隆乳手術的後遺症？
A. 莢膜攣縮（capsular contracture）
B. 感染
C. 植入物破裂滲漏（implant leakage）
D. 荷爾蒙失調

正確答案：D. 荷爾蒙失調